Clinical trial exclusion criterion:
Newborns of substance abusing mothers.

Entity relations:
- AND("mothers", "substance abusing")